Which genes are associated with Epidermolysis Bullosa Simplex?

Recent advances in molecular biology have enabled the association of epidermolysis bullosa simplex (EBS) with point mutations of keratin 14 and/or keratin 5 genes to be established.